Clinical trial exclusion criteria:
Non-English speaking patients
Pregnant women (women of childbearing potential will be advised to undergo regular pregnancy testing)
Patients who had previously undergone operative therapy for the condition

Annotated entities:
- Non-query-able: "Non-English speaking patients"
- Pregnancy_considerations: "Pregnant women (women of childbearing potential will be advised to undergo regular pregnancy testing)"
- Competing_trial: "Patients who had previously undergone operative therapy for the condition"